關於腸道血管結構不良（angiodysplasia）的敘述，何者錯誤？
A. 好發年紀為 60 幾歲
B. 常見部位為盲腸（cecum）及右結腸
C. 在腸黏膜下層可見許多擴張的小血管
D. 有血管內皮細胞異生

正確答案：D. 有血管內皮細胞異生